Subject unwilling to accept a blood transfusion

The above is a clinical trial exclusion criterion. Annotated with entity spans:
[Non-query-able: Subject unwilling to accept a blood transfusion]